Clinical trial exclusion criterion:
Lactation

Annotated entities:
- Condition: "Lactation"